Males aged 18 years and above

The above is a clinical trial inclusion criterion. Annotated with entity spans:
[Person: Males] [Person: aged] [Value: 18 years and above]